一位 70 歲男性，菸齡五十幾年，原本一天抽一包半，膀胱癌手術後改成一天約半包菸，有冠狀動脈心臟病、高血壓、慢性阻塞性肺病，醫師勸他要戒菸。一般而言，下列有關戒菸的敘述，何者錯誤？
A. 長期抽菸者，戒菸後可立即獲得健康上之助益
B. 戒菸可降低得到癌症之機會及降低死亡率
C. 尼古丁是長期抽菸中造成成癮之重要因素
D. 體重減輕是使用尼古丁製劑戒菸時的常見現象

正確答案：D. 體重減輕是使用尼古丁製劑戒菸時的常見現象